Clinical trial exclusion criterion:
inability to tolerate procedure due to hemodynamic instability or severe hypoxemia;

Annotated entities:
- Condition: "inability to tolerate"
- Procedure: "procedure"
- Condition: "hemodynamic instability"
- Condition: "hypoxemia"
- Qualifier: "severe"